Presence of significant cardiac disease (history of unstable ischemic heart disease, heart failure, severe and uncontrolled hypertension) that, in the opinion of the investigator, would put the patient at risk of a clinically significant arrhythmia or myocardial infarction

The above is a clinical trial exclusion criterion. Annotated with entity spans:
Presence of [Qualifier: significant] [Condition: cardiac disease] ([Temporal: history] of [Condition: unstable ischemic heart disease], [Condition: heart failure], [Qualifier: severe] and [Qualifier: uncontrolled] [Condition: hypertension]) that, in the opinion of the investigator, would put the patient [Mood: at risk of] a [Qualifier: clinically significant] [Condition: arrhythmia] or [Condition: myocardial infarction]